Clinical trial exclusion criterion:
Planned kidney transplant in the next 4 months

Entity relations:
- Has_qualifier("kidney transplant", "Planned")
- Has_temporal("kidney transplant", "in the next 4 months")